Sweat chloride equal or greater than 60 mEq/L by quantitative pilocarpine iontophoresis test.

The above is a clinical trial inclusion criterion. Annotated with entity spans:
[Measurement: Sweat chloride] [Value: equal or greater than 60 mEq/L] by [Measurement: quantitative pilocarpine iontophoresis test].